Upper urinary tract deterioration

The above is a clinical trial exclusion criterion. Annotated with entity spans:
[Condition: Upper urinary tract deterioration]